Pregabalin產生止痛作用的相關離子通道為何？
A. sodium channel
B. calcium channel
C. chloride channel
D. potassium channel

正確答案：B. calcium channel